Clinical trial exclusion criterion:
Known to have active viral hepatitis (B or C)

Entity relations:
- Has_qualifier("viral hepatitis", "active")
- Has_qualifier("viral hepatitis", "B")
- OR("B", "C")